Subjects had a history of seizures, neuroleptic malignant syndrome, clinically significant tardive dyskinesia, or other medical condition that would expose them to undue risk or interfere with study assessments.

The above is a clinical trial exclusion criterion. Annotated with entity spans:
Subjects had a [Temporal: history] of [Condition: seizures], [Condition: neuroleptic malignant syndrome], [Qualifier: clinically significant] [Condition: tardive dyskinesia], [Non-representable: or other medical condition that would expose them to undue risk or interfere with study assessments].